Clinical trial exclusion criteria:
History of acute coronary syndrome in the past 30 days.
History of congesting heart failure with left ventricular ejection fraction <30% or exacerbation in the past 30 days.
Current dialysis treatment.
Known furosemide hypersensitivity.
Contraindications to placement of a Foley catheter in the bladder.

Annotated entities:
- Condition: "acute coronary syndrome"
- Temporal: "in the past 30 days"
- Condition: "congesting heart failure"
- Measurement: "left ventricular ejection fraction"
- Value: "<30%"
- Condition: "exacerbation"
- Temporal: "in the past 30 days"
- Procedure: "dialysis treatment"
- Temporal: "Current"
- Drug: "furosemide"
- Condition: "hypersensitivity"
- Condition: "Contraindications"
- Procedure: "placement of a Foley catheter"
- Qualifier: "bladder"